Clinical trial exclusion criterion:
Severe health conditions such as cancer, failure of heart, lung, liver or kidney

Entity relations:
- AND("Severe health conditions", "cancer")
- OR("cancer", "failure of heart", "failure of kidney", "failure of liver", "failure of lung")